Subject is willing and able to comply with all aspects of treatment and evaluation schedule.

The above is a clinical trial inclusion criterion. Annotated with entity spans:
[Non-query-able: Subject is willing and able to comply with all aspects of treatment and evaluation schedule.]